一個剛出生之單側唇顎裂病人要求相關醫師診治，其出生後馬上會面臨的問題是：
A. 語言
B. 餵食
C. 心理
D. 聽力

正確答案：B. 餵食